Clinical trial inclusion criterion:
transit nodules not surgically resectable

Annotated entities:
- Condition: "transit nodules"
- Qualifier: "surgically resectable"
- Negation: "not"
- Procedure: "surgically"